Use of aspirin or salicylate- containing products within 30 days before enrollment

The above is a clinical trial exclusion criterion. Annotated with entity spans:
Use of [Drug: aspirin] or [Drug: salicylate- containing products] [Temporal: within 30 days before enrollment]